Clinical trial exclusion criterion:
Women with ongoing pregnancy or who are breast feeding.

Entity relations:
- Has_temporal("pregnancy", "ongoing")
- OR("pregnancy", "breast feeding")